一位 13 歲的女性病人接受全身麻醉，進行斜視矯正手術。病人身高 161 公分、體重 53 公斤。病人接受 atropine 0.3 毫克、thiopental 300 毫克及 fentanyl 100 微克後，並持續給予氧氣、肌肉鬆弛劑 pancuronium 及吸入性麻藥。手術進行 10 分鐘後，發現血壓由 122 毫米汞柱降至 80，心跳也由每分鐘 90 下降至 50。最有可能的原因是：
A. 缺氧
B. 麻醉深度不夠
C. Pancuronium 的作用
D. 眼外肌受到牽扯

正確答案：D. 眼外肌受到牽扯